Clinical trial exclusion criterion:
Unable to go to clinic visit.

Annotated entities:
- Observation: "Unable"
- Observation: "go to clinic visit"